Clinical trial exclusion criterion:
Denial of signing the consent form.

Annotated entities:
- Negation: "Denial of"
- Informed_consent: "signing the consent form"